Clinical trial exclusion criterion:
Patients with a primary diagnosis of severe acute pancreatitis, without reference to a Ranson score [Ranson 1974]). However, patients with mild or moderate pancreatitis are not excluded;

Entity relations:
- Has_qualifier("acute pancreatitis", "severe")
- Has_negation("Ranson score", "without")
- AND("acute pancreatitis", "Ranson score")
- Has_qualifier("pancreatitis", "mild")
- Has_negation("pancreatitis", "not")
- OR("mild", "moderate")